E. H. es una señora de 64 años, diagnosticada de hipertensión y atendida por su enfermera dentro del programa correspondiente. Las actividades que realiza la enfermera van dirigidas a regular el ejercicio y desarrollo de la agencia de autocuidado de E. H. La señora realiza su autocuidado y regula el ejercicio y desarrollo de su agencia de autocuidado. Esta organización de los cuidados es descrita por Orem como sistema:
1. Parcialmente compensatorio.
2. De apoyo-educación.
3. Totalmente compensatorio.
4. De complementación.
5. De regulación y desarrollo compartidos.

Respuesta correcta: 2. De apoyo-educación.